下列有關pre-T細胞抗原接受器（pre-T cell receptor）的敘述，何者最正確？
A. 具有TCR α鏈（TCR α chain）
B. 具有TCR β鏈（TCR β chain）
C. 可以辨識外來抗原
D. 此階段的細胞大部分都可以辨識自己的主要組織相容性抗原（MHC）

正確答案：B. 具有TCR β鏈（TCR β chain）